La metilación de las bases del DNA:
1. Facilita la unión de los factores de transcripción al DNA.
2. Inactiva al DNA para la transcripción.
3. Evita que la cromatina se desenrolle.
4. Se lleva a cabo por las proteínas de mantenimiento del minicromosoma (MCM).

Respuesta correcta: 2. Inactiva al DNA para la transcripción.